Clinical trial exclusion criterion:
allergic to dexmedetomidine, similar active ingredients or excipients

Annotated entities:
- Drug: "dexmedetomidine"
- Condition: "allergic"
- Drug: "similar active ingredients"
- Drug: "excipients"